Clinical trial exclusion criterion:
Internal, neurologic, rheumatologic or psychiatric disease including current heavy smoking (>20 cigarettes per day)

Annotated entities:
- Qualifier: "Internal"
- Qualifier: "neurologic"
- Qualifier: "rheumatologic"
- Qualifier: "psychiatric"
- Condition: "disease"
- Temporal: "current"
- Observation: "smoking"
- Qualifier: "heavy"
- Value: ">20"
- Measurement: "cigarettes per day"